Clinical trial exclusion criterion:
Subject has active tuberculosis or has had tuberculosis in the past three (3) years.

Annotated entities:
- Condition: "tuberculosis"
- Condition: "tuberculosis"
- Temporal: "in the past three (3) years"